Clinical trial inclusion criterion:
Male or female patients = 18 and = 85 years of age

Annotated entities:
- Person: "Male"
- Person: "female"
- Value: "= 18 and = 85 years"
- Person: "age"